La membrana interna mitocondrial contiene un transportador para:
1. Acetil-CoA.
2. NADH.
3. GTP.
4. Fosfato.

Respuesta correcta: 4. Fosfato.